Which disease is monitored in the BIOCURA cohort?

BiOCura cohort is used to monitor rheumatoid arthritis.